Clinical trial exclusion criterion:
Patients with an allergic reaction to sulfonamide.

Entity relations:
- AND("allergic reaction", "sulfonamide")